Clinical trial exclusion criterion:
BMI less than 18.5

Annotated entities:
- Measurement: "BMI"
- Value: "less than 18.5"